病患突發性臉頰疼痛，欲鑑別上頜竇是否蓄膿，選擇下列那一種 X 光檢查最理想？
A. skull PA view
B. skull lateral view
C. Stenvers view
D. Water's view

正確答案：D. Water's view